Clinical trial inclusion criterion:
giving written consent to participate in the study

Annotated entities:
- Informed_consent: "giving written consent to participate in the study"